Epiretinal membrane and/or vitreomacular traction in the study eye as determined by the central reading center.

The above is a clinical trial exclusion criterion. Annotated with entity spans:
[Condition: Epiretinal membrane] and/or [Condition: vitreomacular traction] [Qualifier: in the study eye] [Non-representable: as determined by the central reading center].